Person in an emergency, life threatening situation.

The above is a clinical trial exclusion criterion. Annotated with entity spans:
Person in an [Observation: emergency], [Observation: life threatening situation].